Clinical trial inclusion criterion:
Free of psychoactive medication for at least: one month for fluoxetine; two weeks for other SSRIs and neuroleptics; and five days for stimulants prior to MRI scanning [excepting stable doses (greater than three months duration) of anticonvulsant medication for seizure disorder]

Annotated entities:
- Drug: "psychoactive medication"
- Negation: "Free of"
- Temporal: "at least one month"
- Temporal: "at least two weeks"
- Temporal: "at least five days"
- Drug: "fluoxetine"
- Drug: "SSRIs"
- Drug: "neuroleptics"
- Drug: "stimulants"
- Temporal: "prior to MRI scanning"
- Drug: "anticonvulsant medication"
- Condition: "seizure disorder"
- Temporal: "greater than three months"
- Qualifier: "stable doses"
- Negation: "excepting"